Clinical trial inclusion criterion:
Posterior spinal fusion

Annotated entities:
- Procedure: "Posterior spinal fusion"